關於基底細胞癌的敘述，下列何者錯誤？
A. 最常見的皮膚癌
B. 具有局部侵犯性
C. 容易轉移
D. 與日光曝曬有關

正確答案：C. 容易轉移